Rheumatic Heart Disease

The above is a clinical trial exclusion criterion. Annotated with entity spans:
[Condition: Rheumatic Heart Disease]